Normal neurologic exam and normal mental status

The above is a clinical trial inclusion criterion. Annotated with entity spans:
[Value: Normal] [Procedure: neurologic exam] and [Value: normal] [Measurement: mental status]